Una valoración potenciométrica se hace siempre a i = 0:
1. Sí, porque es donde se cumple la ecuación de Nerst.
2. Sí, porque es un requisito instrumental.
3. No, porque existen valoraciones potenciométricas a i constante.
4. No, porque nunca se hacen valoraciones potenciométricas a i = 0.
5. Sí, siempre que se utilice un electrodo indicador y otro de referencia.

Respuesta correcta: 3. No, porque existen valoraciones potenciométricas a i constante.